心臟病併左心室功能不良患者之運動訓練，下列何者最不適當？
A. 下肢節律性運動
B. 阻力性運動（resistance exercise）
C. 有氧運動
D. 大肌肉群運動

正確答案：B. 阻力性運動（resistance exercise）